Clinical trial inclusion criterion:
Informed consent for inclusion into the database is obtained

Annotated entities:
- Informed_consent: "Informed consent for inclusion into the database is obtained"